Active liver disease or unexplained persistent elevations of serum transaminases more than three times normal

The above is a clinical trial exclusion criterion. Annotated with entity spans:
Active [Condition: liver disease] or [Qualifier: unexplained] [Qualifier: persistent] [Value: elevations] of [Measurement: serum transaminases] [Value: more than three times normal]